Clinical trial exclusion criterion:
Has a terminal illness with life expectancy < 12 months

Annotated entities:
- Observation: "life expectancy"
- Value: "< 12 months"